Clinical trial inclusion criterion:
Subjects must be 18 years or older

Entity relations:
- Has_value("older", "18 years or older")